四十五歲肺功能正常男性患者，因右中肺葉腫瘤預計接受肺葉切除手術，有關麻醉評估及考慮之敘述，下列何者正確？
A. 影響術後FEV1（forced expiratory volume in first second）最多的就是右肺中葉
B. 預計術後FEV1如大於原有的40%，應可在手術室拔除氣管內管
C. 術中或術後少見心律不整現象
D. 單肺呼吸（one lung ventilation）時使用較大潮氣量（tidal volume），能增加血中含氧量並減少呼吸傷害

正確答案：B. 預計術後FEV1如大於原有的40%，應可在手術室拔除氣管內管